下列關於肺結核治療劑 isoniazid 藥理機制及作用之敘述，何者錯誤？
A. 可抑制分枝桿菌細胞壁成分 mycolic acid 生成
B. 為殺菌型抗生素
C. 若病人肝臟 N-acetyltransferase 活性過高，會使其藥效降低
D. 會誘導肝臟 cytochrome P450 活性明顯增加

正確答案：D. 會誘導肝臟 cytochrome P450 活性明顯增加